Cuánto fármaco se ha eliminado cuando transcurren 3 semividas de eliminación si se ha administrado 100 mg de fármaco por vía IV bolus y se ajusta a un modelo monocompartimental con eliminación de primer orden:
1. 87,5 mg.
2. 12,5 mg.
3. 75 mg.
4. 25 mg.
5. 50 mg.

Respuesta correcta: 1. 87,5 mg.